Clinical trial inclusion criterion:
Recipient is Age = 18 years

Annotated entities:
- Person: "Age"
- Value: "= 18 years"